Clinical trial exclusion criterion:
Stented lesion

Annotated entities:
- Device: "Stented"
- Condition: "lesion"